Clinical trial exclusion criterion:
Tetracycline treatment within two weeks

Annotated entities:
- Drug: "Tetracycline"
- Temporal: "within two weeks"